Patients with psychiatric or addictive disorder that would preclude obtaining informed consent

The above is a clinical trial inclusion criterion. Annotated with entity spans:
Patients with [Condition: psychiatric] or [Condition: addictive disorder] that would preclude obtaining informed consent